Clinical trial inclusion criterion:
Ineffective 1st line treatment (e.g. steroid IV, IVIg) and 2nd line treatment (e.g. Rituximab or cyclophosphamide)

Annotated entities:
- Qualifier: "Ineffective"
- Procedure: "1st line treatment"
- Drug: "steroid IV"
- Drug: "IVIg"
- Procedure: "2nd line treatment"
- Drug: "Rituximab"
- Drug: "cyclophosphamide"